Clinical trial inclusion criterion:
Decompression of the spinal cord following total or partial cervical vertebrectomy

Annotated entities:
- Procedure: "Decompression of the spinal cord"
- Procedure: "partial cervical vertebrectomy"
- Procedure: "total cervical vertebrectomy"